Clinical trial exclusion criterion:
12. Evidence of active infection requiring intravenous or oral antibiotics within 4 weeks of Screening.

Annotated entities:
- Parsing_Error: "12."
- Condition: "infection requiring antibiotics"
- Undefined_semantics: "infection requiring antibiotics"
- Subjective_judgement: "infection requiring antibiotics"
- Temporal: "within 4 weeks of Screening"
- Reference_point: "Screening"